tricyclic antidepressants

The above is a clinical trial exclusion criterion. Annotated with entity spans:
[Drug: tricyclic antidepressants]